Clinical trial exclusion criterion:
Pregnant or lactating female.

Annotated entities:
- Condition: "Pregnant"
- Observation: "lactating"
- Person: "female"